Congestive heart failure (NYHA II-IV).

The above is a clinical trial exclusion criterion. Annotated with entity spans:
[Condition: Congestive heart failure] ([Measurement: NYHA] [Value: II-IV]).